Clinical trial exclusion criterion:
Any prior serious adverse reaction or hypersensitivity to fentanyl, morphine, codeine, hydrocodone, hydromorphone, oxycodone, oxymorphone, naltrexone or naloxone or any of the inactive ingredients in the TDDS (polyester/ethyl vinyl acetate, polyacrylate adhesive, silicone adhesive, dimethicone NF, or polyolefin)

Entity relations:
- Subsumes("TDDS", "polyester/ethyl vinyl acetate")
- AND("hypersensitivity", "fentanyl")
- OR("fentanyl", "morphine", "codeine", "hydrocodone", "hydromorphone", "oxycodone", "oxymorphone", "naltrexone", "naloxone", "TDDS")
- OR("polyester/ethyl vinyl acetate", "polyacrylate adhesive", "silicone adhesive", "dimethicone NF", "polyolefin")